15個月大的孩子，因為兩個月前得到川崎症（Kawasaki disease）而住院，且接受免疫球蛋白靜脈注射治療。現已康復，想要補打疫苗，下列何者為最適合接種的疫苗？
A. 麻疹、德國麻疹、腮腺炎混合疫苗
B. 肺炎鏈球菌疫苗
C. 水痘疫苗
D. 口服輪狀病毒疫苗

正確答案：B. 肺炎鏈球菌疫苗